Por calentamiento en hornos eléctricos de sílice, carburo de calcio y carbón se obtienen siliciuros de calcio. Uno de ellos:
1. Tiene la composición CaSi2.
2. No reacciona con agua.
3. No reacciona con ácido sulfúrico.
4. Es un poderoso agente oxidante.
5. Su reacción con agua líquida genera silicato de calcio.

Respuesta correcta: 1. Tiene la composición CaSi2.